pre-operative opioid analgesics

The above is a clinical trial exclusion criterion. Annotated with entity spans:
[Temporal: pre-operative] [Drug: opioid analgesics]